Urethral stricture or urethro-ileal maldirection

The above is a clinical trial exclusion criterion. Annotated with entity spans:
[Condition: Urethral stricture] or [Condition: urethro-ileal maldirection]